Posterior segment diseases requiring a treatment or threatening the visual prognosis

The above is a clinical trial exclusion criterion. Annotated with entity spans:
[Condition: Posterior segment diseases] [Mood: requiring] a [Procedure: treatment] or [Condition: threatening the visual prognosis]